利用世代研究設計進行病因學探討時，下列何者是研究設計上最主要的重點？
A. 暴露組與對照組的樣本數應該要相等
B. 研究進行初始，有病的研究對象與沒病的研究對象應力求年齡等潛在干擾因子分布平均
C. 所有的研究對象在研究開始前必須確定都未罹患研究所將探討的疾病
D. 所有研究對象必須是來自族群的一個具有代表性樣本

正確答案：C. 所有的研究對象在研究開始前必須確定都未罹患研究所將探討的疾病